Clinical trial inclusion criterion:
Patients who are willing to sign the informed consent form

Annotated entities:
- Post-eligibility: "Patients who are willing to sign the informed consent form"